What is the inheritance pattern of Emery-Dreifuss muscular dystrophy?

The inheritance pattern of Emery-Dreifuss muscular dystrophy (EDMD) can be X-linked, autosomal dominant or autosomal recessive.